What delivery system is used for the Fluzone Intradermal vaccine?

Fluzone was the first influenza vaccine licensed in the USA that uses a new microinjection system for intradermal delivery of vaccines (Soluvia(tm), Becton Dickinson).